Clinical trial exclusion criteria:
cardiac or non-cardiac illness with life expectancy of less than two years;
failure to advance the IVUS catheter through the culprit lesion;
acute coronary syndrome
congestive heart failure NYHA III-IV
diabetes mellitus
chronic kidney disease
previous PCI in the target vessel
heavily calcified vessels
allergy to metformin

Annotated entities:
- Condition: "non-cardiac illness"
- Condition: "cardiac illness"
- Observation: "life expectancy"
- Value: "less than two years"
- Device: "IVUS catheter"
- Procedure: "advance the IVUS catheter"
- Qualifier: "failure"
- Qualifier: "culprit lesion"
- Condition: "acute coronary syndrome"
- Condition: "congestive heart failure"
- Measurement: "NYHA"
- Value: "III-IV"
- Condition: "diabetes mellitus"
- Condition: "chronic kidney disease"
- Procedure: "PCI"
- Temporal: "previous"
- Qualifier: "target vessel"
- Qualifier: "target vessel"
- Condition: "heavily calcified vessels"
- Condition: "allergy"
- Drug: "metformin"